Signed Informed Consent Form

The above is a clinical trial inclusion criterion. Annotated with entity spans:
[Post-eligibility: Signed Informed Consent Form]